Clinical trial inclusion criterion:
permit or license to drive

Annotated entities:
- Observation: "license to drive"
- Observation: "permit to drive"